La validez de una receta médica se extiende:
1. Al ámbito territorial marcado por cada Centro de Salud.
2. Al ámbito territorial de cada Comunidad Autónoma.
3. A todo el territorio nacional.
4. Al ámbito territorial delimitado por cada Área de Salud.

Respuesta correcta: 3. A todo el territorio nacional.